Clinical trial inclusion criterion:
Age ≥18 years

Entity relations:
- Has_value("Age", "≥18 years")